下列有關泌尿系統之敘述，何項錯誤？
A. 右腎較左腎低
B. 輸尿管斜斜進入膀胱壁（距離約 2 公分），形成生理性的狹窄；當膀胱充滿尿時，會壓迫輸尿管，防止尿液逆流
C. 腎竇（renal sinus）指輸尿管上端的膨大處
D. 腎乳頭（renal papilla）為腎錐體（renal pyramid）的尖端

正確答案：C. 腎竇（renal sinus）指輸尿管上端的膨大處